下列何者為最常造成人類病毒性心臟炎（carditis）的病原？
A. 流行性感冒病毒（Influenza virus）
B. 單純疱疹病毒（Herpes simplex virus）
C. B型克沙奇病毒（Coxsackie B virus）
D. 71型腸病毒（Enterovirus 71）

正確答案：C. B型克沙奇病毒（Coxsackie B virus）